Clinical trial exclusion criterion:
Current or past history of any significant psychiatric disorder including, but not limited to, depression (treatment with antidepressants), bipolar disorder, or schizophrenia.

Entity relations:
- Has_qualifier("psychiatric disorder", "significant")
- AND("depression", "antidepressants")
- Subsumes("psychiatric disorder", "depression")
- OR("depression", "bipolar disorder", "schizophrenia")